Clinical trial exclusion criterion:
Bare-metal stent implantation within 1 month prior to TAVI procedure;

Annotated entities:
- Device: "Bare-metal stent"
- Procedure: "implantation"
- Temporal: "within 1 month prior to TAVI procedure"
- Reference_point: "TAVI procedure"
- Procedure: "TAVI procedure"